Patients with pulmonary arterial hypertension (PAH)

The above is a clinical trial inclusion criterion. Annotated with entity spans:
Patients with [Condition: pulmonary arterial hypertension (PAH)]